Clinical trial exclusion criterion:
Known macrovascular disease including coronary artery disease, stroke/TIA or peripheral vascular disease

Annotated entities:
- Condition: "macrovascular disease"
- Condition: "coronary artery disease"
- Condition: "stroke"
- Condition: "TIA"
- Condition: "peripheral vascular disease"